Una molécula no superponible con su imagen especular es definida como:
1. Enantiomérica.
2. Quiral.
3. Diastereomérica.
4. Mesómera.

Respuesta correcta: 2. Quiral.